Clinical trial exclusion criterion:
History of or current history of esophageal cancer invading the submucosal layer of the esophagus or more,

Entity relations:
- Has_qualifier("esophageal cancer", "invading the submucosal layer of the esophagus")
- Has_temporal("esophageal cancer", "History")
- OR("History", "current")